Clinical trial exclusion criterion:
Trastuzumab ≤ 21 days prior to randomization.

Entity relations:
- multi("≤ 21 days prior to randomization", "randomization")
- Has_temporal("Trastuzumab", "≤ 21 days prior to randomization")